Clinical trial exclusion criterion:
Limited English proficiency (LEP)

Annotated entities:
- Observation: "Limited English proficiency"
- Observation: "LEP"